Clinical trial exclusion criteria:
Inability to follow directions or comprehend the English language
Severe uncorrected visual or auditory handicaps
Delirium at screening or baseline
Emergency surgery

Annotated entities:
- Observation: "Inability to follow directions"
- Observation: "Inability to comprehend the English language"
- Qualifier: "Severe"
- Qualifier: "uncorrected"
- Condition: "auditory handicaps"
- Condition: "handicaps visual"
- Temporal: "at screening"
- Temporal: "at baseline"
- Condition: "Delirium"
- Procedure: "Emergency surgery"